Clinical trial inclusion criterion:
MDD Cohort: Meet DSM-5 criteria for Major Depressive Disorder by structured interview (MINI-KID); CDRS-R score >40; Failure to achieve remission with at least 1 adequate prior antidepressant trial (e.g. SSRI, SNRI, or TCA), meaning at least 8 weeks at therapeutic dosing, including at least 4 weeks of stable dosing.

Entity relations:
- Has_qualifier("Major Depressive Disorder", "DSM-5 criteria")
- AND("Major Depressive Disorder", "structured interview")
- Has_value("CDRS-R score", ">40")
- Has_temporal("antidepressant trial", "prior")
- Has_qualifier("antidepressant trial", "adequate")
- Subsumes("antidepressant trial", "SSRI")
- Has_multiplier("antidepressant trial", "at least 1")
- Has_negation("remission", "Failure")
- Has_multiplier("therapeutic dosing", "at least 8 weeks")
- Has_multiplier("stable dosing", "at least 4 weeks")
- AND("antidepressant trial", "therapeutic dosing")
- AND("remission", "antidepressant trial")
- Subsumes("structured interview", "MINI-KID")
- multi("antidepressant trial", "antidepressant")
- AND("MDD Cohort", "Major Depressive Disorder")
- AND("MDD Cohort", "CDRS-R score")
- AND("MDD Cohort", "remission")
- OR("SSRI", "SNRI", "TCA")